Clinical trial exclusion criterion:
Subject unwilling or unable to comply with study procedures

Annotated entities:
- Non-query-able: "Subject unwilling or unable to comply with study procedures"